Known prolonged QTc (or evidence of such at screening) on electrocardiogram defined as >470 ms

The above is a clinical trial exclusion criterion. Annotated with entity spans:
Known prolonged [Measurement: QTc] (or evidence of such at screening) on [Procedure: electrocardiogram] defined as [Value: >470 ms]